下列何者是現今評估吞嚥功能的黃金標準（gold standard）檢查？
A. 壓力測定儀（manometry）
B. 超音波檢查（ultrasound）
C. 錄影螢光吞嚥檢查（videofluorographic swallowing study）
D. 電腦斷層咽喉掃描（CT scan of pharynx）

正確答案：C. 錄影螢光吞嚥檢查（videofluorographic swallowing study）